下列有關杏仁體（amygdaloid body）的敘述，何者錯誤？
A. 接受嗅覺訊息
B. 與邊緣系統有關
C. 與大腦前額葉區（prefrontal area）有密切聯繫
D. 在臨床或生理功能上，杏仁體是基底核的一部分

正確答案：D. 在臨床或生理功能上，杏仁體是基底核的一部分